Intracranial lesion associated with increased intracranial pressure

The above is a clinical trial exclusion criterion. Annotated with entity spans:
[Condition: Intracranial lesion] associated with [Value: increased] [Measurement: intracranial pressure]